Systemic neuromuscular disease known to affect the lower urinary tract

The above is a clinical trial exclusion criterion. Annotated with entity spans:
Systemic [Condition: neuromuscular disease] known to affect the lower urinary tract